De los siguientes compuestos y enzimas ¿Cuál NO participa en el transporte de ácidos grasos al interior de la mitocondria?:
1. Carnitina.
2. Carnitina aciltransferasa I.
3. Carnitina aciltransferasa II.
4. Acil-CoA deshidrogenasa.

Respuesta correcta: 4. Acil-CoA deshidrogenasa.